Clinical trial exclusion criterion:
Evidence of neoplastic diseases of the liver

Entity relations:
- Has_mood("neoplastic diseases", "Evidence of")
- Has_qualifier("neoplastic diseases", "liver")